Clinical trial exclusion criterion:
Liver disease such as cirrhosis or chronic active hepatitis.

Annotated entities:
- Condition: "Liver disease"
- Condition: "cirrhosis"
- Condition: "chronic active hepatitis"